Clinical trial exclusion criteria:
Contraindication to Filgrastim

Annotated entities:
- Condition: "Contraindication"
- Drug: "Filgrastim"